What drug, used to treat rheumatoid arthritis, is an interleukin-1 receptor antagonist?

Anakinra is an oral interleukin-1 receptor antagonist that is used to treat rheumatoid arthritis.